La 2-microglobulina:
1. Es una inmunoglobulina de bajo peso molecular.
2. Se halla en elevada concentración en plaquetas.
3. Filtra libremente por el glomérulo y es secretada por el túbulo.
4. Está ausente en orina.
5. Se encuentra en la superficie de todas la células nucleadas.

Respuesta correcta: 5. Se encuentra en la superficie de todas la células nucleadas.